下列有關頭部受傷（head trauma）引起精神症狀敘述，何者錯誤？
A. 頭部受傷6至12個月後若症狀仍未改善，則可能會慢性化
B. 注意力不集中、記憶變差及學習新資訊有困難是常見的認知功能障礙
C. 行為問題包括：憂鬱、易衝動、攻擊性增加及人格改變
D. 對藥物反應較慢，因此需要較高的初始劑量及較快地調劑速度才能達到療效

正確答案：D. 對藥物反應較慢，因此需要較高的初始劑量及較快地調劑速度才能達到療效